Clinical trial exclusion criterion:
3. A history of cardiac disease, as defined by:

Annotated entities:
- Condition: "cardiac disease"
- Temporal: "history"
- Parsing_Error: "as defined by"